Known human immunodeficiency virus (HIV) positive

The above is a clinical trial exclusion criterion. Annotated with entity spans:
Known [Measurement: human immunodeficiency virus] ([Measurement: HIV]) [Value: positive]